Clinical trial exclusion criterion:
Life expectancy < 6 months (e.g., terminal cancer)

Entity relations:
- Has_value("Life expectancy", "< 6 months")
- Subsumes("Life expectancy", "terminal cancer")